Known allergy to tested drugs

The above is a clinical trial inclusion criterion. Annotated with entity spans:
Known [Condition: allergy] to [Drug: tested drugs]